臨床上要診斷內臟幼蟲移行症（visceral larva migrans）須根據下列那三個診斷依據？
A. 嗜伊紅性白血球增多、脾臟腫大、血清白蛋白增多
B. 嗜中性白血球增多、肝臟腫大、血清球蛋白增多
C. 嗜伊紅性白血球增多、肝臟腫大、血清球蛋白增多
D. 嗜中性白血球增多、脾臟腫大、血清白蛋白增多

正確答案：C. 嗜伊紅性白血球增多、肝臟腫大、血清球蛋白增多